Severity of depression: A 24-Item Hamilton Depression Rating Scale (HDRS) = 20.

The above is a clinical trial inclusion criterion. Annotated with entity spans:
Severity of [Condition: depression]: A [Measurement: 24-Item Hamilton Depression Rating Scale] ([Measurement: HDRS]) [Value: = 20].